Women with breast implants on the same side as the lesion

The above is a clinical trial exclusion criterion. Annotated with entity spans:
[Person: Women] with [Device: breast implants] on the [Qualifier: same side as the lesion]